Adult over 50 years of age.

The above is a clinical trial inclusion criterion. Annotated with entity spans:
[Person: Adult] [Value: over 50 years] of [Person: age].